Previous diagnosis of type 2 diabetes, fulfilling at least one of the following criteria: 1) current treatment with oral antidiabetic drugs and/or insulin; 2) a fasting glucose value above 126 mg/dl on at least 2 occasions; 3) blood glucose level at 2 hours after an oral glucose tolerance test is equal to or more than 200 mg/dl; or 4) a glycated hemoglobin (HbA1c) level > 6.5 %

The above is a clinical trial inclusion criterion. Annotated with entity spans:
[Temporal: Previous] diagnosis of [Condition: type 2 diabetes], fulfilling [Multiplier: at least one] of the following criteria: 1) [Temporal: current] treatment with [Drug: oral antidiabetic drugs] and/or [Drug: insulin]; 2) a [Measurement: fasting glucose] value [Value: above 126 mg/dl] [Multiplier: on at least 2 occasions]; 3) [Measurement: blood glucose level] [Temporal: at 2 hours after an oral glucose tolerance test] is [Value: equal to or more than 200 mg/dl]; or 4) a [Measurement: glycated hemoglobin (HbA1c) level] [Value: > 6.5 %]